Clinical trial exclusion criterion:
Use of anti-allergic with antigen injections in a maximum timeline of 14 days before the vaccination;

Entity relations:
- Has_index("maximum timeline of 14 days before the vaccination", "the vaccination")
- AND("anti-allergic", "antigen injections")
- Has_temporal("anti-allergic", "maximum timeline of 14 days before the vaccination")